下列有關胃上皮細胞息肉（polyp）之敘述，何者錯誤？
A. 腺瘤（adenomatous polyp）占的比例最高可達 75%
B. 增生性息肉（hyperplastic polyp）仍有癌化的風險
C. 是最常見的胃良性腫瘤
D. 異位瘤（heterotopic polyp）與缺陷瘤（hamartoma）癌化的風險極低

正確答案：A. 腺瘤（adenomatous polyp）占的比例最高可達 75%